王先生於三個月前右上肢遭受嚴重燒傷，經手術和固定一個月後開始接受復健運動及伸展，近來右肘關節附近疼痛逐漸加劇且關節活動範圍逐漸減少，且有壓痛之情形，下列何者是最可能之原因？
A. 肘關節脫臼
B. 蜂窩性組織炎
C. 異位性骨化
D. 橈神經麻痺

正確答案：C. 異位性骨化